¿Qué modelo de Evaluación psicológica contempla conjuntamente los objetivos básicos de: Descripción, Clasificación, Comparación y Predicción?
1. Modelo Clínico-dinámico, perspectiva médico-psiquiátrica.
2. Modelo Humanista.
3. Modelo Clínico-dinámico, perspectiva Psicoanalítica.
4. Modelo Conductual.
5. Modelo Psicométrico, Correlacional o del Atributo.

Respuesta correcta: 5. Modelo Psicométrico, Correlacional o del Atributo.